Clinically significant cardiac disease (New York Heart Association Class III/IV),or severe debilitating puhnonary disease.

The above is a clinical trial exclusion criterion. Annotated with entity spans:
Clinically [Qualifier: significant] [Condition: cardiac disease] ([Measurement: New York Heart Association] [Value: Class III/IV]),or [Qualifier: severe] [Condition: debilitating puhnonary disease].